Clinical trial exclusion criterion:
American Society of Anesthesiologists physical-health status classification (ASA-PS)>3

Entity relations:
- Has_value("American Society of Anesthesiologists physical-health status classification (ASA-PS)", ">3")